系統發炎反應症候群（systemic inflammatory response syndrome）的定義包括下列那幾項？①體溫＜ 36℃ ②WBC＞12000/mm3 ③PaCO2＜40 mmHg ④心跳＞100 bpm
A. ①②
B. ①④
C. ②③
D. ②④

正確答案：A. ①②